Clinical trial inclusion criterion:
Diagnosed with head and neck cancer and treated for a period of up to 5 years with radiotherapy where the major salivary glands (parotid, submandibular and sublingual) were included in the radiation field;

Annotated entities:
- Condition: "head and neck cancer"
- Temporal: "5 years"
- Procedure: "radiotherapy"
- Qualifier: "major salivary glands"
- Qualifier: "parotid"
- Qualifier: "submandibular"
- Qualifier: "sublingual"